La ecuación de velocidad de una reacción química:
1. Se debe determinar a partir de medidas cinéticas y no se puede deducir directamente de la estequiometria de la reacción.
2. Permite asignar a la constante de la velocidad las unidades de s-1 (s = segundo).
3. Depende del orden total de reacción que, a su vez, se obtiene de los coeficientes estequiométricos de los productos.
4. Informa detalladamente sobre el mecanismo de reacción.
5. Depende de las condiciones experimentales del proceso.

Respuesta correcta: 1. Se debe determinar a partir de medidas cinéticas y no se puede deducir directamente de la estequiometria de la reacción.